NSAID use within the past 48 hours

The above is a clinical trial exclusion criterion. Annotated with entity spans:
[Drug: NSAID] use [Temporal: within the past 48 hours]